Women with expected difficult IUD insertion like nulliparous women and women with previous cesarean section.

The above is a clinical trial inclusion criterion. Annotated with entity spans:
[Person: Women] with [Mood: expected] [Qualifier: difficult] [Procedure: IUD insertion] like [Observation: nulliparous] [Person: women] and [Person: women] with [Temporal: previous] [Procedure: cesarean section].